Clinical trial inclusion criteria:
Patients scheduled for laser laryngeal surgery under general anesthesia with either Propofol or desflurane based technique.

Annotated entities:
- Mood: "scheduled"
- Procedure: "laser laryngeal surgery"
- Procedure: "general anesthesia"
- Drug: "Propofol"
- Drug: "desflurane"